Clinical trial inclusion criterion:
Serum transaminases ≤2.5 x ULN.

Annotated entities:
- Measurement: "Serum transaminases"
- Value: "≤2.5 x ULN"